下列關於眼窩的敘述，何者錯誤？
A. 眼窩的容積大約30 cc
B. 眼眶骨共有七塊
C. 眼眶骨最薄處位於眼眶底（orbital floor），故外傷時容易造成眼眶底骨折
D. 眼眶骨外壁（lateral wall）由蝶骨大翼（greater wing of sphenoid bone）和顴骨

正確答案：C. 眼眶骨最薄處位於眼眶底（orbital floor），故外傷時容易造成眼眶底骨折